significant unstable medical condition or life threatening disease with anticipated survival of less than 6 months;

The above is a clinical trial exclusion criterion. Annotated with entity spans:
significant [Qualifier: unstable] [Condition: medical condition] or [Condition: life threatening disease] with [Observation: anticipated survival] of [Value: less than 6 months];